not diabetic patient;

The above is a clinical trial exclusion criterion. Annotated with entity spans:
[Negation: not] [Condition: diabetic] patient;